小洞性梗塞（lacunar infarction）最常出現之症狀為何？
A. 單純運動性半身不遂（pure motor hemiparesis）
B. 感覺運動症候群（sensorimotor syndrome）
C. 失調性半身不遂（ataxic hemiparesis）
D. 單純感覺性症候群（pure sensory syndrome）

正確答案：A. 單純運動性半身不遂（pure motor hemiparesis）